Clinical trial inclusion criterion:
= 5 episodes of VT treated with antitachycardia pacing (ATP) regardless of symptoms

Annotated entities:
- Multiplier: "5 episodes"
- Condition: "VT"
- Procedure: "antitachycardia pacing"
- Procedure: "ATP"